Weight >1900g at time of delivery

The above is a clinical trial inclusion criterion. Annotated with entity spans:
[Measurement: Weight] [Value: >1900g] [Temporal: at time of delivery]